Clinical trial exclusion criterion:
Any condition that in the investigator's opinion would make the subject unable to adhere to the trial visit schedule and procedures

Annotated entities:
- Post-eligibility: "Any condition that in the investigator's opinion would make the subject unable to adhere to the trial visit schedule and procedures"